Clinical trial inclusion criteria:
Age 19 and more
On dual or triple antiplatelet therapy and between 12months and 14months from Bioresorbable Vascular Scaffold implantation
No history of death, serious myocardial infarction, stroke, repeat revascularization, or major bleeding

Annotated entities:
- Person: "Age"
- Value: "19 and more"
- Procedure: "triple antiplatelet therapy"
- Procedure: "dual antiplatelet therapy"
- Temporal: "between 12months and 14months from Bioresorbable Vascular Scaffold implantation"
- Device: "Bioresorbable Vascular Scaffold"
- Procedure: "implantation"
- Reference_point: "Bioresorbable Vascular Scaffold implantation"
- Negation: "No"
- Temporal: "history"
- Condition: "death"
- Qualifier: "serious"
- Condition: "myocardial infarction"
- Condition: "stroke"
- Multiplier: "repeat"
- Procedure: "revascularization"
- Qualifier: "major"
- Condition: "bleeding"